評估血液透析劑量是否足夠，最常用的指標為：
A. 再循環速率（recirculation rate）
B. KT / V
C. 血液流速（blood flow rate）
D. 透析液流速（dialysate flow rate）

正確答案：B. KT / V